Clinical trial exclusion criterion:
Have used drugs for weight loss within 1 month of screening.

Annotated entities:
- Drug: "drugs for weight loss"
- Temporal: "within 1 month of screening"